Clinical trial inclusion criterion:
Diagnosed hepato-biliary disease/inflammation

Annotated entities:
- Condition: "hepato-biliary disease"
- Condition: "hepato-biliary inflammation"